Which is the target of belimumab in Systemic Lupus Erythematosus treatment?

belimumab is a blys-specificsor for systemic lupus erythematos